stable metabolic status

The above is a clinical trial inclusion criterion. Annotated with entity spans:
[Qualifier: stable] [Measurement: metabolic status]